Clinical trial inclusion criteria:
patients classified with American Society of Anesthesiologists Physical Status Classification System as 1 or 2 status
planned eye surgery under sedation

Annotated entities:
- Measurement: "status American Society of Anesthesiologists Physical Status Classification System"
- Value: "1 or 2"
- Mood: "planned"
- Procedure: "eye surgery"
- Qualifier: "under sedation"
- Procedure: "sedation"